Clinical trial exclusion criterion:
Has portal vein invasion at the main portal branch (Vp4), inferior vena cava, or cardiac involvement of HCC based on imaging

Entity relations:
- Has_qualifier("portal vein invasion", "main portal branch (Vp4)")
- AND("portal vein invasion", "imaging")
- AND("portal vein invasion", "HCC")
- OR("main portal branch (Vp4)", "inferior vena cava")
- OR("portal vein invasion", "cardiac involvement")